Clinical trial exclusion criterion:
Body Mass Index (BMI) > 32

Annotated entities:
- Measurement: "Body Mass Index (BMI)"
- Value: "> 32"